Able to understand and provide informed consent for participation.

The above is a clinical trial inclusion criterion. Annotated with entity spans:
[Informed_consent: Able to understand and provide informed consent for participation].